Clinical trial inclusion criterion:
Treatment with GLP1 (glucagon-like peptide) analogue or insulin

Annotated entities:
- Drug: "GLP1 (glucagon-like peptide) analogue"
- Drug: "insulin"
- Procedure: "Treatment"